Are currently managed at home (outpatients), are ambulatory and able to travel to the clinic. Subjects can be treated with all relevant COPD medication. This includes vaccines, inhaled short-acting beta-2-agonists as needed, short-acting or long-acting anticholinergics (tiotropium), systemic beta-2-agonists, theophylline, mucolytics, antioxidants, beta-1-agonists (for cardiovascular indication), non-invasive ventilation, long term oxygen therapy and can have Cor Pulmonale.

The above is a clinical trial inclusion criterion. Annotated with entity spans:
Are currently [Observation: managed at home] ([Observation: outpatients]), are [Condition: ambulatory] and [Observation: able to travel to the clinic]. Subjects can be treated with all relevant [Drug: COPD medication]. This includes [Drug: vaccines], [Drug: inhaled short-acting beta-2-agonists] as needed, [Drug: short-acting] or [Drug: long-acting anticholinergics] ([Drug: tiotropium]), [Drug: systemic beta-2-agonists], [Drug: theophylline], [Drug: mucolytics], [Drug: antioxidants], [Drug: beta-1-agonists] (for [Condition: cardiovascular indication]), [Condition: non-invasive ventilation], [Multiplier: long term] [Procedure: oxygen therapy] and can have [Condition: Cor Pulmonale].